Clinical trial exclusion criterion:
Has a history of (non-infectious) pneumonitis that required steroids or current pneumonitis.

Entity relations:
- Has_temporal("pneumonitis", "current")
- Has_temporal("pneumonitis", "history")
- AND("required steroids", "steroids")
- Has_qualifier("pneumonitis", "required steroids")
- OR("pneumonitis", "pneumonitis")